Clinical trial exclusion criterion:
methotrexate,

Annotated entities:
- Drug: "methotrexate"